Clinical trial exclusion criterion:
Patients affected by metabolic or thyroid disorders;

Annotated entities:
- Condition: "metabolic disorders"
- Condition: "thyroid disorders"